Any other variety of LAL

The above is a clinical trial exclusion criterion. Annotated with entity spans:
Any [Qualifier: other variety] of [Condition: LAL]